Clinical trial inclusion criterion:
3. Have a positive finding on MBI that is < 2 cm in size and requires additional diagnostic workup with focused ultrasound.

Annotated entities:
- Grammar_Error: "MBI"
- Procedure: "MBI"
- Condition: "positive finding"
- Undefined_semantics: "positive finding"
- Value: "< 2 cm"
- Measurement: "size"
- Undefined_semantics: "requires additional diagnostic workup with focused ultrasound"
- Subjective_judgement: "requires additional diagnostic workup with focused ultrasound"